Clinical trial exclusion criterion:
BMI = 35 or weight < 50 kg

Entity relations:
- Has_value("BMI", "= 35")
- Has_value("weight", "< 50 kg")
- OR("BMI", "weight")